Clinical trial exclusion criterion:
Drug-eluting stent implantation within 3 months prior to TAVI procedure;

Entity relations:
- multi("TAVI procedure", "TAVI procedure")
- Has_index("within 3 months prior to TAVI procedure", "TAVI procedure")
- AND("implantation", "Drug-eluting stent")
- Has_temporal("implantation", "within 3 months prior to TAVI procedure")